Clinical trial exclusion criterion:
Diagnosed psychiatric or cognitive disorders

Annotated entities:
- Condition: "cognitive disorders"
- Condition: "psychiatric disorders"